Clinical trial exclusion criterion:
Clinically significant active suicidal ideation or self-injurious behavior necessitating immediate treatment, as determined by the investigator.

Annotated entities:
- Condition: "suicidal ideation"
- Condition: "self-injurious behavior"
- Procedure: "treatment"
- Qualifier: "immediate"
- Qualifier: "active"